Clinical trial exclusion criterion:
Currently requiring chronic dialysis

Annotated entities:
- Procedure: "chronic dialysis"
- Condition: "requiring chronic dialysis"
- Temporal: "Currently"